How many pseudogenes are contained in the C. elegans genome?

Evidence suggesting that a fifth of annotated Caenorhabditis elegans genes may be pseudogenes